Men and women aged 18-45 years.

The above is a clinical trial inclusion criterion. Annotated with entity spans:
[Person: Men] and [Person: women] [Person: aged] [Value: 18-45 years].